El primer ruido cardíaco coincide con:
1. Final de la sístole ventricular.
2. Inicio de la sístole auricular.
3. Apertura de la válvula aórtica.
4. Cierre de las válvulas aurículo-ventriculares.

Respuesta correcta: 4. Cierre de las válvulas aurículo-ventriculares.